輸尿管（ureter）的胚胎起源為何？
A. 後腎中胚層（metanephric mesoderm）
B. 原腎（pronephros）
C. 中腎（mesonephros）
D. 後腎憩室（metanephric diverticulum）

正確答案：D. 後腎憩室（metanephric diverticulum）